Subject has normal ECG parameters (QRS width in the 12 channel surface ECG =120 ms, QTc - interval < 440 ms, PQ - interval = 210 ms; all parameters should be measured at sinus rhythm).

The above is a clinical trial inclusion criterion. Annotated with entity spans:
Subject has [Value: normal] [Procedure: ECG] parameters ([Measurement: QRS width] in the [Qualifier: 12 channel surface ECG] [Value: =120 ms], [Measurement: QTc - interval] [Value: < 440 ms], [Measurement: PQ - interval] [Value: = 210 ms]; all parameters should be measured at [Condition: sinus rhythm]).